85歲的陳婆婆最近3個月內跌倒了3次，還好都沒有明顯的受傷，今天來到門診做跌倒評估，醫師發現她有使用安眠藥的習慣，白內障導致她視力不佳，下肢肌力也不足，下列各項醫療建議，何者最不合適？
A. 藥物調整，減少安眠藥使用，教導正確的睡眠衛生習慣
B. 尋求眼科醫師幫忙，考慮開刀治療白內障
C. 利用運動與復健增加下肢肌力
D. 服用維生素B增加下肢肌力

正確答案：D. 服用維生素B增加下肢肌力